What genes is implicated in myotonic goats and other  nondystrophic myotonias?

The following genes are implicated in myotonic goats and other nondystrophic myotonias: clcn1 (also known as mbnl1), gcic-1, scn4a, clc-1 and dmpk.